Clinical trial inclusion criterion:
ASA I

Entity relations:
- Has_value("ASA", "I")